¿Cuál de estas vías de activación del complemento se pone en marcha tras la unión de anticuerpos a sus antígenos específicos?:
1. Vía clásica.
2. Vía alternativa.
3. Vía de las lectinas.
4. Vía iniciada por la proteína MBL (“mannose-binding lectin”).

Respuesta correcta: 1. Vía clásica.